What makes telomerase a good drug target?

Human telomerase is absent in most normal tissues, but is abnormally activated in all major cancer cells. Telomerase enables tumor cells to maintain telomere length, allowing indefinite replicative capacity. telomerase is believed to be necessary for cancer cells to grow without limit